下列何者因受到十二指腸中葡萄糖所刺激而分泌，進而刺激胰島素（insulin）分泌？
A. 胃抑素（gastric inhibitory polypeptide）
B. 胃泌素（gastrin）
C. 運動素（motilin）
D. 腸促胰泌素（secretin）

正確答案：A. 胃抑素（gastric inhibitory polypeptide）